¿Cuál de los siguientes indicadores se utiliza en la determinación de la dureza del agua?:
1. Fenoftaleína.
2. Azul de bromofenol.
3. Negro de eriocromo T.
4. Azul de metileno.

Respuesta correcta: 3. Negro de eriocromo T.